Clinical trial inclusion criterion:
2. Male or female ≥ 18 years of age.

Entity relations:
- Has_value("age", "≥ 18 years")
- OR("Male", "female")